Clinical trial exclusion criterion:
Absence of documentation of negative tuberculin skin test, negative QuantiFERON-TB Gold test, or treatment for latent tuberculosis prior to starting treatment with the anti-TNF agent

Annotated entities:
- Negation: "Absence of"
- Value: "negative"
- Procedure: "tuberculin skin test"
- Value: "negative"
- Measurement: "QuantiFERON-TB Gold test"
- Qualifier: "latent"
- Condition: "tuberculosis"
- Procedure: "treatment"
- Temporal: "prior to starting treatment with the anti-TNF agent"
- Reference_point: "starting treatment with the anti-TNF agent"
- Procedure: "treatment with the anti-TNF agent"
- Drug: "anti-TNF agent"